ventral hernia repair

The above is a clinical trial exclusion criterion. Annotated with entity spans:
[Condition: ventral hernia] [Procedure: repair]